Clinical trial inclusion criterion:
a crown-rump length = 6mm and no cardiac activity OR

Entity relations:
- Has_negation("cardiac activity", "no")
- Has_value("crown-rump length", "= 6mm")